Clinical trial exclusion criterion:
Artificial heart valves requiring treatment with an anticoagulant

Entity relations:
- AND("Artificial heart valves", "anticoagulant")